下列何者不發生於近距離之調焦作用（accommodation）？
A. 第三對顱神經副交感節前纖維興奮
B. 睫狀肌（ciliary muscle）收縮
C. 水晶體懸韌帶（suspensory ligaments of lens）被拉緊
D. 水晶體變凸變厚

正確答案：C. 水晶體懸韌帶（suspensory ligaments of lens）被拉緊